Prior history of hypersensitivity to sildenafil

The above is a clinical trial exclusion criterion. Annotated with entity spans:
[Temporal: Prior history] of [Condition: hypersensitivity] to [Drug: sildenafil]